Others

The above is a clinical trial exclusion criterion. Annotated with entity spans:
[Non-query-able: Others]